Clinical trial inclusion criterion:
Male or female >=18 years of age.

Entity relations:
- Has_value("age", ">=18 years")
- OR("Male", "female")